胸膜壁層（parietal pleura）的上皮屬於下列何者？
A. 單層扁平上皮（simple squamous epithelium）
B. 單層柱狀上皮（simple columnar epithelium）
C. 單層立方上皮（simple cuboidal epithelium）
D. 移形上皮（transitional epithelium）

正確答案：A. 單層扁平上皮（simple squamous epithelium）